Clinical trial exclusion criterion:
Drug or alcohol dependence, or abuse within the past 3 months, soy-bean oil allergy

Entity relations:
- Has_temporal("Drug dependence", "within the past 3 months")
- OR("Drug dependence", "alcohol abuse", "alcohol dependence", "Drug abuse")
- OR("Drug dependence", "soy-bean oil allergy")